Clinical trial exclusion criterion:
Pain on hip or ankle

Entity relations:
- Has_qualifier("Pain", "hip")
- OR("hip", "ankle")